Which molecular does daratumumab target?

Daratumumab is an anti-CD38 antibody.